Incipient and established diabetic nephropathy (urinary albumin excretion ≥ 100 mg/day but ≤ 2000 mg/day).

The above is a clinical trial inclusion criterion. Annotated with entity spans:
Incipient and established [Condition: diabetic nephropathy] ([Measurement: urinary albumin excretion] [Value: ≥ 100 mg/day] but [Value: ≤ 2000 mg/day]).